有關癌症患者化學治療期間發生細菌感染，在下列何種情況最常見？
A. corticosteroid治療
B. 中性顆粒細胞（neutrophil）計數<500/µL
C. Hb<7 gm/dL
D. 體重損失>10%

正確答案：B. 中性顆粒細胞（neutrophil）計數<500/µL